ST-segment elevation acute myocardial infarction patients during the first 12 hours of sympton onset;

The above is a clinical trial inclusion criterion. Annotated with entity spans:
[Qualifier: ST-segment elevation] [Condition: acute myocardial infarction] patients [Temporal: during the first 12 hours of sympton onset];